Clinical trial inclusion criterion:
patients undergoing venous malformation embolization operation through general anesthesia.

Entity relations:
- AND("venous malformation embolization operation", "general anesthesia")